Clinical trial exclusion criterion:
Patients who had history of systemic antibiotic usage over the previous 4 months

Entity relations:
- Has_temporal("systemic antibiotic", "over the previous 4 months")
- Has_temporal("systemic antibiotic", "history")